Use of any prohibited concomitant medications within 30 days of the Baseline/Day 1 visit.

The above is a clinical trial exclusion criterion. Annotated with entity spans:
[Post-eligibility: Use of any prohibited concomitant medications within 30 days of the Baseline/Day 1 visit.]